眼外肌中，其肌腱附著於眼球外後上方者為：
A. 外直肌（lateral rectus）
B. 上直肌（superior rectus）
C. 下直肌（inferior rectus）
D. 上斜肌（superior oblique）

正確答案：D. 上斜肌（superior oblique）